Clinical trial inclusion criterion:
histologically diagnosed primary classical osteosarcoma in extremities

Annotated entities:
- Procedure: "histologically"
- Qualifier: "primary"
- Condition: "classical osteosarcoma"
- Qualifier: "in extremities"